一位吞嚥困難病患，臨床主訴胸部灼熱感（heart burn），且併有食物卡住（food sticking）之感覺，依吞嚥期分期，下列那一期最可能受損？
A. 口腔期（oral stage）
B. 口腔準備期（oral preparatory stage）
C. 咽喉期（pharyngeal stage）
D. 食道期（esophageal stage）

正確答案：D. 食道期（esophageal stage）